List 3 features of IRVAN syndrome.

Idiopathic retinal vasculitis, aneurysms, and neuroretinitis is coined as IRVAN syndrome.